Clinical trial exclusion criterion:
Overlap syndrome with Primary Sclerosing Cholangitis (PSC) or Primary Biliary Cholangitis (PBC) (Paris criteria, strong positive Anti-Mitochondrial Antibodies (AMA), past liver biopsy or cholangiographic findings compatible with PBC or PSC).

Entity relations:
- Subsumes("Primary Sclerosing Cholangitis", "PSC")
- Subsumes("Primary Biliary Cholangitis", "PBC")
- AND("Overlap syndrome", "Primary Sclerosing Cholangitis")
- Subsumes("Anti-Mitochondrial Antibodies", "AMA")
- Has_value("Anti-Mitochondrial Antibodies", "strong positive")
- AND("liver biopsy", "PBC")
- AND("PBC", "PSC")
- OR("Primary Sclerosing Cholangitis", "Primary Biliary Cholangitis")
- OR("liver biopsy", "cholangiographic findings")